prospectively with an EDSS change of at least 1.0 points over the last two years, or

The above is a clinical trial inclusion criterion. Annotated with entity spans:
prospectively with an [Condition: EDSS change] of [Value: at least 1.0 points] [Temporal: over the last two years], or